Clinical trial exclusion criterion:
Habitual use of opioids

Entity relations:
- Has_multiplier("opioids", "Habitual use")